Clinical trial exclusion criterion:
15. Lack of availability for immunological and clinical follow-up assessment.

Annotated entities:
- Parsing_Error: "15."
- Negation: "Lack of"
- Procedure: "immunological follow-up assessment"
- Procedure: "clinical follow-up assessment"
- Mood: "availability for"